Clinical trial exclusion criterion:
Known contact with an INH or rifampin resistant case

Annotated entities:
- Condition: "resistant"
- Drug: "rifampin"
- Drug: "INH"